Clinical trial inclusion criterion:
Body weight >= 50 kilogram (kg) and body mass index within the range 19 - 24.9 kg/m^2 (inclusive).

Annotated entities:
- Measurement: "Body weight"
- Value: ">= 50 kilogram (kg)"
- Measurement: "body mass index"
- Value: "within the range 19 - 24.9 kg/m^2"